Clinical history of lactose-intolerance or allergies to cow-milk

The above is a clinical trial exclusion criterion. Annotated with entity spans:
Clinical history of [Condition: lactose-intolerance] or [Condition: allergies to cow-milk]